Clinical trial inclusion criterion:
Presumed AJCC (American Joint Committee on Cancer) tumor Stage I or II

Annotated entities:
- Measurement: "AJCC tumor Stage I"
- Measurement: "American Joint Committee on Cancer"
- Value: "I"
- Value: "II"